Clinical trial exclusion criterion:
bone-specific pretreatment (DMAB, TPTD, strontium ranelate, SERMs) Bisphosphonate treatment is allowed

Annotated entities:
- Procedure: "bone-specific pretreatment"
- Drug: "DMAB"
- Drug: "TPTD"
- Drug: "SERMs"
- Drug: "strontium ranelate"
- Non-representable: "Bisphosphonate treatment is allowed"